Any other condition that in the opinion of the Investigator would interfere with the evaluation of the study results or constitute a health hazard for the patient

The above is a clinical trial exclusion criterion. Annotated with entity spans:
[Post-eligibility: Any other condition that in the opinion of the Investigator would interfere with the evaluation of the study results or constitute a health hazard for the patient]